Clinical trial inclusion criterion:
patients scheduled to undergo hip arthroplasty

Entity relations:
- Has_mood("hip arthroplasty", "scheduled to undergo")